La causa más frecuente de la pancreatitis aguda es:
1. Colelitiasis.
2. Alcohol.
3. Hipertrigliceridemia.
4. Fármacos.

Respuesta correcta: 1. Colelitiasis.